Absence of dyspnea

The above is a clinical trial inclusion criterion. Annotated with entity spans:
[Negation: Absence of] [Condition: dyspnea]